Newly diagnosed patients with previous excisional biopsy. OR

The above is a clinical trial inclusion criterion. Annotated with entity spans:
Newly diagnosed patients with [Temporal: previous] [Procedure: excisional biopsy]. OR